Clinical trial exclusion criterion:
Previous receipt of meningococcal B vaccine (Bexsero)

Entity relations:
- Subsumes("meningococcal B vaccine", "Bexsero")
- Has_temporal("meningococcal B vaccine", "Previous")